Clinical trial exclusion criterion:
Immunosuppression with cyclosporine or an mTOR inhibitor (everolimus or sirolimus).

Annotated entities:
- Procedure: "Immunosuppression"
- Drug: "cyclosporine"
- Drug: "mTOR inhibitor"
- Drug: "everolimus"
- Drug: "sirolimus"